Clinical trial exclusion criterion:
Patients with allergies to narcotics or local anesthetic; or anticoagulant use (e.g. warfarin, dabigatran, rivaroxaban).

Entity relations:
- AND("allergies", "narcotics")
- Subsumes("anticoagulant", "warfarin")
- AND("allergies", "local anesthetic")
- OR("warfarin", "dabigatran", "rivaroxaban")
- OR("allergies", "anticoagulant")